下列何者不是瘧疾預防性藥物？
A. chloroquine
B. doxycycline
C. Malarone（atovaquone/proguanil）
D. quinine

正確答案：D. quinine